Which protein pathway is regulating SGK1-mediated phosphorylation of FOXO3a to control cell proliferation?

mTORC1, in coordination with mTORC2, controls cell proliferation by regulating FoxO3a gene expression and SGK1-mediated phosphorylation of FOXO3a at Ser314.